Clinical trial inclusion criterion:
Patients who test positive for HBsAg are ineligible

Entity relations:
- Has_value("HBsAg", "positive")